with mechanical ventilation initiated in the first 48 hours following hospital admission

The above is a clinical trial inclusion criterion. Annotated with entity spans:
with [Procedure: mechanical ventilation] initiated in the [Temporal: first 48 hours following hospital admission]